下列有關治療癲癇（epilepsy）藥物 phenytoin 之藥理作用之敘述，何者錯誤？
A. Phenytoin 會抑制神經元連續性動作電位（repetitive firing）的發生
B. Phenytoin為一種鈉離子管道阻斷劑（Na＋ channel blocker）
C. Phenytoin 會縮短鈉離子管道不活化期（inactivation state）的時間
D. Phenytoin 會減少興奮性麩胺酸鹽（glutamate）的神經傳遞作用

正確答案：C. Phenytoin 會縮短鈉離子管道不活化期（inactivation state）的時間